Según el fenómeno de facilitación social cuando una persona desarrolla una tarea mal aprendida en presencia de otros, la ejecución de dicha tarea:
1. Mejora levemente.
2. Mejora sustantivamente.
3. No se modifica.
4. Empeora.
5. No es predictible.

Respuesta correcta: 4. Empeora.